Feeding tube

The above is a clinical trial exclusion criterion. Annotated with entity spans:
[Device: Feeding tube]